Clinical trial exclusion criterion:
Treatment with strong CYP3A4-inhibitors (e.g. ketoconazole, clarithromycin, nefazodone, ritonavir or atazanavir)

Entity relations:
- Subsumes("strong CYP3A4-inhibitors", "ketoconazole")
- OR("ketoconazole", "atazanavir", "nefazodone", "clarithromycin", "ritonavir")